Which pipelines are used for analyzing data from ChIP-nexus experiments?

PeakXus and Q-nexus enable comprehensive transcription factor binding site discovery from ChIP-nexus experiments.